Clinical trial exclusion criterion:
The patient, in the opinion of the Investigator, is unable to adhere to the requirements of the study.

Annotated entities:
- Non-query-able: "The patient, in the opinion of the Investigator, is unable to adhere to the requirements of the study"